Clinical trial exclusion criterion:
Patients with active GIT bleeding.

Entity relations:
- Has_qualifier("GIT bleeding", "active")